Clinical trial inclusion criterion:
Age=18 years and =80 years;

Annotated entities:
- Person: "Age"
- Value: "=18 years and =80 years"